serum alanine transaminase (ALT) ≤ 2.5 x ULN (in case of liver metastases < 5 x ULN)

The above is a clinical trial inclusion criterion. Annotated with entity spans:
[Measurement: serum alanine transaminase (ALT)] [Value: ≤ 2.5 x ULN] (in case of [Condition: liver metastases] [Value: < 5 x ULN])